Clinical trial exclusion criterion:
Type 1 diabetes mellitus or diabetic ketoacidosis

Entity relations:
- OR("Type 1 diabetes mellitus", "diabetic ketoacidosis")